那一種荷爾蒙α次單元（α-subunit）與促黃體素（LH）α次單元相同？
A. 泌乳激素（prolactin）
B. 促腎上腺皮質素（ACTH）
C. 生長素（GH）
D. 人絨膜促性素（hCG）

正確答案：D. 人絨膜促性素（hCG）